一位 12 歲女孩主訴兩側頸部及腋下淋巴結腫大。淋巴結病理切片檢查顯示瀰漫性淋巴細胞增生，並破壞原有淋巴結之結構。淋巴細胞表現 CD3 及 TdT，但並不具 CD20、CD56 或 CD30 之標記。此病人之淋巴瘤（lymphoma）應屬何型？
A. 小淋巴球淋巴瘤（Small lymphocytic lymphoma）
B. T 淋巴母細胞淋巴瘤（T lymphoblastic lymphoma）
C. 套膜細胞淋巴瘤（Mantle cell lymphoma）
D. 鼻類 NK/T 細胞淋巴瘤（Nasal NK/T cell lymphoma）

正確答案：B. T 淋巴母細胞淋巴瘤（T lymphoblastic lymphoma）